Clinical trial exclusion criterion:
History of sickle cell trait or disease or any other acquired or hereditary hematological abnormality

Entity relations:
- OR("sickle cell trait", "acquired hematological abnormality", "sickle cell disease", "hereditary hematological abnormality")